Clinical trial exclusion criterion:
Orthopedic and neurological diseases that may preclude the achievement of the cardiopulmonary test and Cardiac Rehabilitation exercises;

Annotated entities:
- Condition: "neurological diseases"
- Condition: "Orthopedic"
- Qualifier: "preclude the achievement of the cardiopulmonary test and Cardiac Rehabilitation exercises"